To understand the impossibility of participating in another clinical trial during the time of participation in the study, until 6 months after its conclusion;

The above is a clinical trial inclusion criterion. Annotated with entity spans:
[Non-query-able: To understand the impossibility of participating in another clinical trial during the time of participation in the study, until 6 months after its conclusion;]